Clinical trial exclusion criterion:
Previous receipt of meningococcal B vaccine (Bexsero)

Annotated entities:
- Temporal: "Previous"
- Drug: "meningococcal B vaccine"
- Drug: "Bexsero"